Patients with a history of bladder cancer or patients with active bladder cancer

The above is a clinical trial exclusion criterion. Annotated with entity spans:
Patients with a history of [Condition: bladder cancer] or patients with [Qualifier: active] [Condition: bladder cancer]